Clinical trial exclusion criteria:
Evidence of low ovarian reserve by at least one of the following: AMH = 1,5 ng/mL and/or basal CD 3 FSH = 10 mIU/mL and/or basal CD 3 Estradiol = 60 ng/mL and/or previous egg collection yield = 3 oocytes.
Preexisting medical condition (thyroid disease, diabetes mellitus, hypertension, pulmonary conditions, cardiac condition…).
Severe male factor infertility (Total motile sperm count < 5 million/ml and/or normal WHO morphology <20%).
Hypersensitivity to Heparin or its derivatives.
Acquired thrombophilia.
Active hemorrhage or increased risk of bleeding due to impairment of homeostasis.
Severe impairment of liver or pancreatic function.
Severe renal insufficiency (Creatinine Clearance < 30 ml/min).
Injuries to or operations on the central nervous system, eyes and ears within the last 2 months.
Disseminated Intravascular Coagulation (DIC) attributable to heparin-induced thrombocytopenia.
Acute bacterial endocarditis and endocarditis lenta.
Any organic lesion with high risk of bleeding (e.g.: active peptic ulcer, hemorrhagic stroke, cerebral aneurysm or cerebral neoplasms).

Annotated entities:
- Condition: "low ovarian reserve"
- Measurement: "AMH"
- Value: "= 1,5 ng/mL"
- Measurement: "basal CD 3 FSH"
- Value: "= 10 mIU/mL"
- Measurement: "basal CD 3 Estradiol"
- Value: "= 60 ng/mL"
- Measurement: "egg collection yield"
- Value: "= 3 oocytes"
- Condition: "thyroid disease"
- Condition: "diabetes mellitus"
- Condition: "hypertension"
- Condition: "pulmonary conditions"
- Condition: "cardiac condition"
- Condition: "male factor infertility"
- Qualifier: "Severe"
- Measurement: "Total motile sperm count"
- Value: "< 5 million/ml"
- Measurement: "normal WHO morphology"
- Value: "<20%"
- Condition: "Hypersensitivity"
- Drug: "Heparin"
- Condition: "thrombophilia"
- Qualifier: "Acquired"
- Condition: "Active hemorrhage"
- Observation: "risk of bleeding"
- Qualifier: "increased"
- Condition: "impairment of homeostasis"
- Condition: "impairment of liver"
- Condition: "impairment of pancreatic function"
- Qualifier: "Severe"
- Qualifier: "Severe"
- Condition: "renal insufficiency"
- Measurement: "Creatinine Clearance"
- Value: "< 30 ml/min"
- Procedure: "operations"
- Condition: "Injuries"
- Qualifier: "central nervous system"
- Qualifier: "eyes"
- Qualifier: "ears"
- Temporal: "last 2 months"
- Condition: "Disseminated Intravascular Coagulation"
- Condition: "DIC"
- Condition: "heparin-induced thrombocytopenia"
- Condition: "endocarditis lenta"
- Condition: "Acute bacterial endocarditis"
- Condition: "organic lesion"
- Observation: "risk of bleeding"
- Qualifier: "high"
- Condition: "active peptic ulcer"
- Condition: "hemorrhagic stroke"
- Condition: "cerebral aneurysm"
- Condition: "cerebral neoplasms"